Voluntarily participated and Written informed consent signed

The above is a clinical trial inclusion criterion. Annotated with entity spans:
[Observation: Voluntarily participated] and [Observation: Written informed consent signed]